unilateral ovariectomy

The above is a clinical trial exclusion criterion. Annotated with entity spans:
[Qualifier: unilateral] [Procedure: ovariectomy]